有關脂多醣（lipopolysaccharides）內毒素（endotoxin）導致病人死亡的敘述，下列何者錯誤？
A. 甲氧西林抗藥性金黃色葡萄球菌（Methicillin-Resistant Staphylococcus aureus）產生之內毒素是可能的禍首
B. 廣泛的血管內凝固（disseminated intravascular coagulation），可能是致死原因之一
C. 病人可能死於低血壓（hypotension）
D. 可引起發燒及休克，導致死亡

正確答案：A. 甲氧西林抗藥性金黃色葡萄球菌（Methicillin-Resistant Staphylococcus aureus）產生之內毒素是可能的禍首